Clinical diagnosis of stable plaque psoriasis with involvement of = 10% body surface area (excluding face and scalp)

The above is a clinical trial inclusion criterion. Annotated with entity spans:
Clinical diagnosis of [Qualifier: stable] [Condition: plaque psoriasis] with involvement of [Value: = 10%] [Measurement: body surface area] ([Negation: excluding] [Condition: face] [Grammar_Error: and] [Condition: scalp])